Clinical trial inclusion criteria:
Habitual dietary sodium intake > 3400mg per day

Annotated entities:
- Measurement: "dietary sodium intake"
- Value: "> 3400mg per day"